Clinical trial inclusion criterion:
Ability and willingness to take oral study medications

Annotated entities:
- Post-eligibility: "Ability and willingness to take oral study medications"